Clinical trial inclusion criterion:
High risk patients: General Surgery AKI Risk Index Class III, IV or V

Annotated entities:
- Condition: "High risk"
- Measurement: "General Surgery AKI Risk Index"
- Value: "Class III, IV or V"